Clinical trial inclusion criterion:
Meet at least 3 of 5 National Cholesterol Education Adult Treatment Panel III

Entity relations:
- Has_value("National Cholesterol Education Adult Treatment Panel III", "at least 3 of 5")